How does exercise affect thyroid hormone receptors expression in the heart?

Exercise has been shown to increase  TRβ1 receptor expression in young rats.  Exercise has been shown to increase both TRα1 and  TRβ1 receptor expression in aged rats.